Age 18 to 55 years old (inclusive) as of the date the ICF is signed

The above is a clinical trial inclusion criterion. Annotated with entity spans:
[Person: Age] [Value: 18 to 55 years old (]inclusive) as of the date the ICF is signed